Which type of analysis does DeSeq2 perform?

DESeq2 is a method for differential analysis of count data. It is used for the calculation of fold change and dispersion of RNA-seq data.